Clinical trial exclusion criterion:
Major surgery within 4 weeks

Entity relations:
- Has_qualifier("surgery", "Major")
- Has_temporal("surgery", "within 4 weeks")